Clinical trial exclusion criterion:
Weight <45kg

Annotated entities:
- Measurement: "Weight"
- Value: "<45kg"